Clinical trial exclusion criterion:
(relative) Known contraindications for initiation of eplerenone treatment (hyperkalemia, abnormal renal clearance, severe hepatic insufficiency (Child-Pugh C), type 2 diabetes mellitus with microalbuminuria, concomitant use of potassium supplements, potassium-sparing diuretics, strong CYP3A4 inhibitors, or the combination of an ACE-inhibitor and an angiotensin receptor blocking agent). Pregnancy will not be routinely tested in female patients, but the possibility of pregnancy will be discussed during screening;

Annotated entities:
- Condition: "contraindications"
- Drug: "eplerenone"
- Condition: "hyperkalemia"
- Condition: "abnormal renal clearance"
- Measurement: "renal clearance"
- Value: "abnormal"
- Condition: "severe hepatic insufficiency"
- Measurement: "Child-Pugh"
- Value: "C"
- Condition: "type 2 diabetes mellitus"
- Condition: "microalbuminuria"
- Temporal: "concomitant"
- Drug: "potassium supplements"
- Drug: "potassium-sparing diuretics"
- Drug: "strong CYP3A4 inhibitors"
- Drug: "ACE-inhibitor"
- Drug: "angiotensin receptor blocking agent"
- Non-representable: "Pregnancy will not be routinely tested in female patients, but the possibility of pregnancy will be discussed during screening;"